Clinical trial inclusion criterion:
F; age 18 to 70

Annotated entities:
- Person: "F"
- Person: "age"
- Value: "18 to 70"